have a writing medical permission to participate in the training program.

The above is a clinical trial inclusion criterion. Annotated with entity spans:
[Non-query-able: have a writing medical permission to participate in the training program].